Woman of child-bearing potential not taking adequate contraception deemed reliable by the investigator.

The above is a clinical trial exclusion criterion. Annotated with entity spans:
[Pregnancy_considerations: Woman of child-bearing potential not taking adequate contraception deemed reliable by the investigator.]